Patients used to alcohol or drug (medication) abuse;

The above is a clinical trial exclusion criterion. Annotated with entity spans:
Patients used to [Condition: alcohol] or [Condition: drug] ([Condition: medication]) abuse;